Clinical trial inclusion criteria:
Type 2 diabetes mellitus with HbA1c > 7.5 %
Body mass index > 35 and < 50 kg/m2
Candidate for Gastric By-Pass
Treatment with GLP1 (glucagon-like peptide) analogue or insulin

Annotated entities:
- Condition: "Type 2 diabetes mellitus"
- Measurement: "HbA1c"
- Value: "> 7.5 %"
- Measurement: "Body mass index"
- Value: "> 35 and < 50 kg/m2"
- Procedure: "Gastric By-Pass"
- Mood: "Candidate"
- Drug: "GLP1 (glucagon-like peptide) analogue"
- Drug: "insulin"
- Procedure: "Treatment"